List Cdk targets that are dephosphorylated during cytokinesis

Downregulation of cyclin-dependent kinase (Cdk) activity, together with upregulation of its counteracting phosphatase Cdc14, controls each of the sequential steps of cytokinesis, including furrow ingression, membrane resolution and cell separation in budding yeast. Aip1, Ede1 and Inn1 are Cdk targets that are dephosphorylated at the time of cytoklesis.